Clinical trial exclusion criterion:
Need for premedication

Annotated entities:
- Drug: "premedication"
- Mood: "Need for"